Clinical trial exclusion criterion:
Patients with planned concomitant surgical or transcatheter ablation for Atrial Fibrillation.

Annotated entities:
- Procedure: "surgical ablation"
- Procedure: "transcatheter ablation"
- Condition: "Atrial Fibrillation"
- Mood: "planned"
- Temporal: "concomitant"